Clinical trial exclusion criterion:
HCV co-infection

Entity relations:
- Has_qualifier("co-infection", "HCV")